Clinical trial exclusion criterion:
Lower respiratory tract infection within the 4 weeks prior to Visit 1 .

Annotated entities:
- Condition: "Lower respiratory tract infection"
- Temporal: "within the 4 weeks prior to Visit 1"
- Reference_point: "Visit 1"